Clinical trial inclusion criteria:
Patients undergoing colon resection

Annotated entities:
- Condition: "colon resection"
- Temporal: "undergoing"